Clinical trial inclusion criterion:
Normal bone marrow reserve function and normal liver, kidney function

Annotated entities:
- Measurement: "bone marrow reserve function"
- Value: "Normal"
- Measurement: "kidney function"
- Measurement: "liver function"
- Value: "normal"